下列何者是用來判斷病人是否罹患甲狀腺功能低下（hypothyroidism）的最佳指標？
A. 血漿中甲狀腺素結合球蛋白（thyroxine-binding globulin）濃度降低
B. 血漿中甲狀腺素總量（total plasma T4，T3，RT3）降低
C. 血漿中游離態甲狀腺素濃度降低
D. 血漿中甲狀腺刺激素（thyroid stimulating hormone）濃度降低

正確答案：C. 血漿中游離態甲狀腺素濃度降低